Have had one prior platinum-based chemotherapy regimen for the treatment of primary disease.

The above is a clinical trial inclusion criterion. Annotated with entity spans:
Have had one [Temporal: prior] [Drug: platinum-based chemotherapy regimen] for the treatment of [Condition: primary disease].